El error alcalino que se produce en los electrodos de vidrio para la media de pH:
1. Se debe a la presencia de una concentración excesiva de protones que se sustituye por iones sodio en la membrana de vidrio.
2. Ocurre a pH neutros debido a la ausencia de protones.
3. Tiene lugar a pH muy alcalinos, en los que el ion sodio se comporta como si fuera un protón.
4. Aparece como consecuencia de la deshidratación de la membrana de vidrio.
5. Ocurre cuando el electrodo se introduce en agua pura debido a la disolución de los iones sodio de la membrana.

Respuesta correcta: 3. Tiene lugar a pH muy alcalinos, en los que el ion sodio se comporta como si fuera un protón.